維生素 D3 的主要生理作用為何？
A. 促進近側腎小管的鈣離子吸收
B. 促進亨利氏彎管粗上行枝的鈣離子吸收
C. 促進腸胃道的鈣離子吸收
D. 促進皮質收集管的鈣離子吸收

正確答案：C. 促進腸胃道的鈣離子吸收